Clinical trial exclusion criterion:
Use of any investigational or non-registered drug or vaccine product within 30 days preceding the administration of the study vaccine or planned use within the first six weeks of the study period

Entity relations:
- Has_index("within 30 days preceding the administration of the study vaccine", "the administration of the study vaccine")
- Has_mood("within the first six weeks of the study period", "planned use")
- Has_index("within the first six weeks of the study period", "the study period")
- Has_qualifier("drug", "investigational")
- Has_temporal("drug", "within 30 days preceding the administration of the study vaccine")
- OR("investigational", "non-registered")
- OR("drug", "vaccine product")
- OR("within 30 days preceding the administration of the study vaccine", "within the first six weeks of the study period")